骨化性肌炎（myositis ossificans）病灶中的骨頭組織，最可能為何種變化？
A. 異生（dysplasia）
B. 增生（hyperplasia）
C. 萎縮（atrophy）
D. 化生（metaplasia）

正確答案：D. 化生（metaplasia）